婦女有微小泌乳激素瘤懷孕時，下列敘述何者最適當？
A. 終止懷孕
B. 定期追蹤視野有助臨床評估
C. 產後不可哺餵母乳
D. MRI 評估沒有用處

正確答案：B. 定期追蹤視野有助臨床評估